La estimulación simpática inhibe la:
1. Frecuencia cardiaca.
2. Digestión.
3. Producción y liberación de glucosa.
4. Sudoración.

Respuesta correcta: 2. Digestión.